Clinical trial exclusion criterion:
has ever taken Xyrem / sodium oxybate / GHB at any time

Annotated entities:
- Drug: "Xyrem"
- Drug: "sodium oxybate"
- Drug: "GHB"
- Temporal: "ever"